Clinical trial exclusion criterion:
Patients with a known diagnosis e.g. upper gastrointestinal cancer

Annotated entities:
- Condition: "upper gastrointestinal cancer"
- Condition: "known diagnosis"